控制疼痛的非藥物方法，不包括下列何者？
A. transcutaneous electrical nerve stimulation（TENS）
B. acupuncture
C. behavioral modification
D. celiac plexus block

正確答案：D. celiac plexus block